Clinical trial inclusion criterion:
Hepatitis B e antigen (HBeAg)-negative.

Annotated entities:
- Measurement: "Hepatitis B e antigen"
- Measurement: "HBeAg"
- Value: "negative"